How is CTCF activated post-translationally?

The chromatin insulator protein CTCF carries a post-translational modification: poly(ADP-ribosyl)ation.